Age 18 to 75 years old (male or female).

The above is a clinical trial inclusion criterion. Annotated with entity spans:
[Person: Age] [Value: 18 to 75 years old] ([Person: male] or [Person: female]).